Clinical trial inclusion criterion:
Impaired glucose regulation diagnostic criteria according to 1998 WHO diagnostic criteria.

Entity relations:
- Has_qualifier("Impaired glucose regulation", "1998 WHO diagnostic criteria")